Repeated episodes of severe hypoglycaemia within the last six months prior to Screening

The above is a clinical trial exclusion criterion. Annotated with entity spans:
[Multiplier: Repeated] episodes of [Condition: severe hypoglycaemia] [Temporal: within the last six months prior to Screening]